Subject are pregnant

The above is a clinical trial exclusion criterion. Annotated with entity spans:
Subject are [Condition: pregnant]